Clinical trial exclusion criterion:
Any confirmed or suspected immunosuppressive or immunodeficiency condition based on medical history and physical examination

Annotated entities:
- Qualifier: "confirmed"
- Mood: "suspected"
- Condition: "immunosuppressive condition"
- Condition: "immunodeficiency condition"
- Temporal: "medical history"
- Procedure: "physical examination"